有關骨骼肌細胞的dihydropyridine receptors之敘述，下列何者正確？
A. 為位於橫管膜（T tubule membrane）上的ligand-gated 鈣離子管道（Ca2+ channel）
B. 為位於肌漿網（sarcoplasmic reticulum）上的voltage-gated鈣離子管道（Ca2+ channel）
C. 為位於橫管膜（T tubule membrane）上的voltage-gated鈣離子管道（Ca2+ channel）
D. 為位於肌漿網（sarcoplasmic reticulum）上的ligand-gated鈣離子管道（Ca2+ channel）

正確答案：C. 為位於橫管膜（T tubule membrane）上的voltage-gated鈣離子管道（Ca2+ channel）